Clinical trial inclusion criterion:
Abbreviated MDRD eGFR = 30 mL/min/1.73m2.

Entity relations:
- Has_value("MDRD eGFR", "= 30 mL/min/1.73m2")